Clinical trial exclusion criterion:
Epileptic seizures that are not adequately controlled by Treatment

Entity relations:
- Has_negation("adequately controlled", "not")
- Has_qualifier("Epileptic seizures", "adequately controlled")